Clinical trial exclusion criterion:
Previous cardiac surgery (including CABG) within the past 6 months (180 days)

Annotated entities:
- Procedure: "cardiac surgery"
- Temporal: "Previous"
- Procedure: "CABG"
- Temporal: "within the past 6 months (180 days)"